Planned goal TSH suppression 0.1-0.5 mU/L for at least 18 weeks postoperatively

The above is a clinical trial inclusion criterion. Annotated with entity spans:
Planned goal [Condition: TSH suppression] [Value: 0.1-0.5 mU/L] for [Temporal: at least 18 weeks postoperatively]